使用 desflurane 施行麻醉時，若在短時間內增加 desflurane 劑量，以加深麻醉深度時，最容易出現下列何種短暫的現象？
A. 心率不變
B. 血壓降低
C. 病患血中 catecholamine 濃度比給予 isoflurane 的病患還高
D. 心輸出量不變

正確答案：C. 病患血中 catecholamine 濃度比給予 isoflurane 的病患還高